Clinical trial exclusion criterion:
latex allergy

Annotated entities:
- Condition: "allergy"
- Drug: "latex"